Clinical trial exclusion criterion:
Patients unwilling or unable to provide informed consent

Annotated entities:
- Informed_consent: "Patients unwilling or unable to provide informed consen"